Which part of the TNFR2 gene is genetically associated with Systemic Lupus Erythematosus?

There is a TNFR2 3' flanking region polymorphism in systemic lupus erythematosus.